有關膽道囊腫，下列敘述何者錯誤？
A. 依Todani分類囊腫型態一共分為五大型
B. 病人典型的三個症狀是腹痛、黃疸與右上腹摸到腫塊
C. 手術與否端視病人是否有症狀，無症狀者不必手術
D. 如果進行手術是做囊腫切除與Roux-en-Y肝管空腸吻合

正確答案：C. 手術與否端視病人是否有症狀，無症狀者不必手術